Which R package can infer protein-protein interactions via thermal proximity coaggregation (TPCA)?

Rtpca is an R package implementing methods for inferring protein-protein interactions based on thermal proteome profiling experiments of a single condition or in a differential setting via an approach called thermal proximity coaggregation (TPCA). It offers user-friendly tools to explore datasets for their protein-protein interaction predictive performance and easily integrates with available R packages.